下列有關肺膿瘍（lung abscess）的敘述，何者錯誤？
A. 肺膿瘍最常見之原因為血行性感染
B. 須作支氣管鏡檢查，看是否有腫瘤或異物阻塞氣道
C. 肺膿瘍病人如發生大咳血須考慮手術切除
D. 肺膿瘍病人可先以有效抗生素與呼吸治療來醫治

正確答案：A. 肺膿瘍最常見之原因為血行性感染